手腕腹側有一個腕隧道（Carpal tunnel），內有那一條神經通過？
A. 橈神經（Radial nerve）
B. 正中神經（Median nerve）
C. 尺神經（Ulnar nerve）
D. 肌皮神經（Musculocutaneous nerve）

正確答案：B. 正中神經（Median nerve）